Patients with either Relapsing-remitting MS (RRMS), Secondary progressive MS (SPMS), or Primary progressive MS (PPMS) by McDonald 2010 criteria.

The above is a clinical trial inclusion criterion. Annotated with entity spans:
Patients with either [Condition: Relapsing-remitting MS (RRMS)], [Condition: Secondary progressive MS (SPMS)], or [Condition: Primary progressive MS (PPMS)] by McDonald 2010 criteria.